Clinical trial inclusion criterion:
Current diagnosis of otolaryngeal cancer and undergoing surgery with general anesthesia

Annotated entities:
- Condition: "otolaryngeal cancer"
- Temporal: "undergoing"
- Procedure: "surgery"
- Procedure: "general anesthesia"